Clinical trial inclusion criterion:
no history of anesthesia medication allergy.

Annotated entities:
- Negation: "no"
- Temporal: "history"
- Drug: "anesthesia medication"
- Condition: "allergy"